Clinical trial exclusion criterion:
children under 3 months of age

Annotated entities:
- Person: "children"
- Value: "under 3 months"
- Person: "age"